家族性大腸息肉症（Familial adenomatous polyposis）與下列何種基因變異關係最密切？
A. APC/β-catenin
B. RB gene
C. p53 gene
D. TGF-β receptor

正確答案：A. APC/β-catenin